Which is the gene most commonly mutated in Tay-Sachs disease?

HEXA gene, encoding the alpha-subunit of the lysosomal enzyme, beta-N-acetylhexosaminidase A